下列何者最宜口服來治療陰道念珠球菌感染？
A. Griseofulvin
B. Fluconazole
C. Flucytosine
D. Nystatin

正確答案：B. Fluconazole